Concomitant use of simvastatin/lovastatin > 40 mg qd

The above is a clinical trial inclusion criterion. Annotated with entity spans:
[Temporal: Concomitant] use of [Drug: simvastatin]/[Drug: lovastatin] [Multiplier: > 40 mg qd]